Acompañan a las células endoteliales en los capilares:
1. Podocitos.
2. Células mesangiales.
3. Pericitos.
4. Miocitos.

Respuesta correcta: 3. Pericitos.